Liver Transplant Recipients have been treated with twice-daily regimen of tacrolimus(TAC) plus everolimus(EVR) and TAC and EVR trough levels have stayed within targeted ranges for at least 6 weeks prior to enrollment

The above is a clinical trial inclusion criterion. Annotated with entity spans:
[Person: Liver Transplant Recipients] have been treated with [Multiplier: twice-daily] regimen of [Drug: tacrolimus(TAC)] plus [Drug: everolimus(EVR)] and [Measurement: TAC] and [Measurement: EVR trough levels] have stayed [Value: within targeted ranges] [Temporal: for at least 6 weeks prior to enrollment]